5. Female patients of childbearing potential must have a negative pregnancy test at screening and must agree to use hormonal contraceptive, intrauterine device, diaphragm with spermicide, condom with spermicide, or abstinence throughout until 2 weeks after the last administration of study drug

The above is a clinical trial inclusion criterion. Annotated with entity spans:
[Parsing_Error: 5.] [Person: Female] patients of [Condition: childbearing potential] must have a [Value: negative] [Measurement: pregnancy test] [Temporal: at screening] and must agree to use [Drug: hormonal contraceptive], [Device: intrauterine device], [Device: diaphragm with spermicide], [Device: condom with spermicide], or [Observation: abstinence] [Temporal: throughout until 2 weeks after the last administration of study drug]